Clinical trial inclusion criterion:
Subjects aged 18 years or older, at the time of signing the informed consent.

Entity relations:
- Has_value("aged", "18 years or older")
- Has_index("at the time of signing the informed consent", "signing the informed consent")
- Has_temporal("aged", "at the time of signing the informed consent")